Clinical trial exclusion criterion:
Any immunosuppressive disorder, such as HIV infection, common variable immunodeficiency, active cancers or chemotherapy.

Annotated entities:
- Condition: "immunosuppressive disorder"
- Condition: "HIV infection"
- Condition: "common variable immunodeficiency"
- Temporal: "active"
- Condition: "cancers"
- Procedure: "chemotherapy"